Clinical trial inclusion criterion:
Level of SCI C3-T1, AIS A & B;

Annotated entities:
- Measurement: "Level of SCI"
- Value: "C3-T1"
- Measurement: "AIS"
- Value: "A & B"